Clinical trial exclusion criterion:
BMI >37

Entity relations:
- Has_value("BMI", ">37")